缺脂性皮膚炎（asteatotic eczema）主要發生在那一個年齡層？
A. 小孩
B. 青少年
C. 壯年人
D. 老年人

正確答案：D. 老年人